Clinical trial exclusion criterion:
untreated thyroid pathology

Annotated entities:
- Condition: "thyroid pathology"
- Qualifier: "untreated"